Clinical trial inclusion criterion:
Be at least 21 years of age.

Entity relations:
- Has_value("age", "at least 21 years")